Clinical trial exclusion criterion:
Pregnant or breastfeeding.

Annotated entities:
- Condition: "Pregnant"
- Observation: "breastfeeding"